Clinical trial exclusion criterion:
ED physicians who work casually (less than 0.25 Full Time Equivalent)

Annotated entities:
- Non-query-able: "ED physicians who work casually (less than 0.25 Full Time Equivalent)"